心肌梗塞後心室中隔破裂（post-infarction septal defect）的死亡率高，下列的說明何者是不正確的？
A. 多發生於心肌梗塞後一週內
B. 多見於高血壓、老人家及血栓溶解治療後之病人
C. 病人呈現低血壓或休克，需要主動脈內氣球幫送治療（Intra-aortic balloon counterpulsation）
D. 應俟血液循環穩定後，才可從事外科手術治療

正確答案：D. 應俟血液循環穩定後，才可從事外科手術治療